List available circular RNA prediction tools.

circRNA_finder, find_circ, CIRCexplorer, CIRI, and MapSplice.